¿Cuál es la geometría molecular del compuesto ClF3:
1. Plana trigonal.
2. Piramidal.
3. Forma de “T”.
4. Tetraédrica.

Respuesta correcta: 3. Forma de “T”.